Clinical trial inclusion criterion:
pregnant or lactating women,

Annotated entities:
- Condition: "pregnant"
- Condition: "lactating"
- Person: "women"